一位 12 歲的脊髓脊膜膨出（myelomenigocele）患者，在過去半年內出現急速變化的脊柱側彎，下列敘述何者錯誤？
A. 可能是脊髓牽扯（tethered spinal cord）產生
B. 治療以手術放鬆（surgical detethering）為主
C. 通常大小便功能正常
D. 反覆的屈曲及伸展可能造成脊髓的微梗塞（microinfarction）

正確答案：C. 通常大小便功能正常